Clinical trial exclusion criterion:
Prior use of any experimental agent used as a DMT for MS in the last five years

Annotated entities:
- Non-query-able: "Prior use of any experimental agent used as a DMT for MS in the last five years"